En las células animales la citocinesis ocurre por:
1. La presión externa ejercida por las fibras de colágeno tipo VI.
2. Un anillo contráctil de alfa-tubulina.
3. La fusión de vesículas secretoras.
4. Anillo contráctil de filamentos de actina y miosina.

Respuesta correcta: 4. Anillo contráctil de filamentos de actina y miosina.